The Shingrix vaccine is used to prevent what disease?

The Shingrix vaccine prevents Postherpetic neuralgia, also known as Shingles, which is caused by herpes zoster (HZ)